Clinical trial exclusion criterion:
Patients with renal impairment (serum creatinine more than twice the upper limit of normal).

Entity relations:
- Has_value("serum creatinine", "more than twice the upper limit of normal")
- AND("renal impairment", "serum creatinine")